¿Cuál de los siguientes valores es el más cercano al valor estimado para el incremento de energía libre estándar de la hidrólisis de ATP?
1. – 1,4 Kcal/mol.
2. – 2,6 Kcal/mol.
3. + 3,5 Kcal/mol.
4. – 7,0 Kcal/mol.
5. + 7,0 Kcal/mol.

Respuesta correcta: 4. – 7,0 Kcal/mol.